Clinical trial exclusion criterion:
Alcohol or illicit drug use, which in the investigators opinion may affect participation in study.

Entity relations:
- OR("Alcohol use", "illicit drug use")